Clinical trial exclusion criteria:
use of any sedative hypnotics, tranquilizers, anticonvulsants, antihistamines (except non-sedating), benzodiazepines, clonidine or any medication known to affect dopamine at start of baseline period
significant unstable or uncontrolled medical/psychiatric disease
significant history of head trauma/surgery or seizure disorder
radiation exposure exceeding 20mSv in last 12 months
pregnancy
substance abuse/dependence (including alcohol)
have sleep apnea, or are shift workers
on a sodium-restricted diet
has ever taken Xyrem / sodium oxybate / GHB at any time
claustrophobia
metal implants / objects in the body that may interfere with MRI
succinic semialdehyde dehydrogenase deficiency

Annotated entities:
- Drug: "sedative hypnotics"
- Drug: "tranquilizers"
- Drug: "anticonvulsants"
- Drug: "antihistamines"
- Qualifier: "non-sedating"
- Negation: "except"
- Drug: "benzodiazepines"
- Drug: "clonidine"
- Drug: "medication known to affect dopamine"
- Temporal: "at start of baseline period"
- Qualifier: "significant"
- Qualifier: "uncontrolled"
- Qualifier: "unstable"
- Condition: "psychiatric disease"
- Condition: "medical disease"
- Condition: "head trauma"
- Procedure: "head surgery"
- Condition: "seizure disorder"
- Temporal: "history"
- Qualifier: "significant"
- Condition: "radiation exposure"
- Value: "exceeding 20mSv"
- Temporal: "in last 12 months"
- Condition: "pregnancy"
- Condition: "substance abuse"
- Condition: "substance dependence"
- Drug: "alcohol"
- Condition: "sleep apnea"
- Person: "shift workers"
- Procedure: "sodium-restricted diet"
- Drug: "Xyrem"
- Drug: "sodium oxybate"
- Drug: "GHB"
- Temporal: "ever"
- Condition: "claustrophobia"
- Device: "metal implants"
- Device: "metal objects"
- Mood: "may interfere with"
- Procedure: "MRI"
- Condition: "succinic semialdehyde dehydrogenase deficiency"